¿Cuál de los siguientes antibióticos podría emplearse en un paciente con hipersensibilidad a la penicilina por pruebas cutáneas?:
1. Piperacilina/tazobactam.
2. Aztreonam.
3. Ampicilina.
4. Amoxicilina
5. Ceftazidima.

Respuesta correcta: 2. Aztreonam.